Clinical trial exclusion criterion:
Gastroscopy planned at the same time.

Annotated entities:
- Procedure: "Gastroscopy"
- Mood: "planned"
- Temporal: "at the same time"